當肺泡氧分壓（alveolar PO2）由 100 mmHg 突然降至 50 mmHg。此時，體循環動脈血中的那些數值會減少？①動脈血氧分壓（PaO2） ②動脈血氧飽和度（arterial hemoglobin oxygen saturation）  ③血液氧氣總量（total oxygen content）
A. 僅①②
B. 僅①③
C. 僅②③
D. ①②③

正確答案：D. ①②③